強迫症患者，臨床上強迫思想（obsession）的型式有下列四種較常見，其出現的機率排序由高到低，何者正確？①對稱性（symmetry） ②病態性懷疑（pathological doubt） ③無恥或得罪的念頭 （intrusive thoughts）：例如：色情或攻擊性的念頭 ④污染（contamination）
A. ④②③①
B. ②④③①
C. ④②①③
D. ②④①③

正確答案：A. ④②③①